Estimated CrCl < 60 mL/min

The above is a clinical trial exclusion criterion. Annotated with entity spans:
[Measurement: Estimated CrCl] [Value: < 60 mL/min]